Clinical trial exclusion criterion:
Inability to use a PCA device or speak the English language

Annotated entities:
- Device: "PCA device"
- Observation: "Inability to use"
- Observation: "Inability to speak the English language"